Immunosuppressant therapy

The above is a clinical trial exclusion criterion. Annotated with entity spans:
[Procedure: Immunosuppressant therapy]